Clinical trial exclusion criterion:
Patient declined informed consent

Annotated entities:
- Negation: "declined"
- Competing_trial: "informed consent"